Clinical trial inclusion criterion:
HIV- uninfected women desiring PrEP

Entity relations:
- Has_mood("PrEP", "desiring")